Clinical trial exclusion criterion:
Presence of a serious medical illness including cardiac, hepatic, renal, respiratory, endocrinologic, neurologic, or hematologic disease or physical disorder judged to significantly affect central nervous system function

Entity relations:
- Has_qualifier("medical illness", "serious")